Patients taking B-blockers or Ca channel blockers.

The above is a clinical trial exclusion criterion. Annotated with entity spans:
Patients taking [Drug: B-blockers] or [Drug: Ca channel blockers].